Contraindications for MRI, including, but not limited to pacemaker, aneurysm clips, neurostimulators, cochlear implants, metal in eyes, steel worker, intra-uterine devices for birth control.

The above is a clinical trial exclusion criterion. Annotated with entity spans:
[Condition: Contraindications] for [Procedure: MRI], including, but [Negation: not] limited to [Device: pacemaker], [Device: aneurysm clips], [Device: neurostimulators], [Device: cochlear implants], [Device: metal] in [Qualifier: eyes], [Device: steel worker], [Device: intra-uterine devices] for birth control.